Patients with an allergic reaction to sulfonamide.

The above is a clinical trial exclusion criterion. Annotated with entity spans:
Patients with an [Condition: allergic reaction] to [Drug: sulfonamide].